What is TissueEnrich?

TissueEnrich is a tool that calculates tissue-specific gene enrichment in an input gene set. TissueEnrich can assign tissue identities to single cell clusters and differentiated embryonic stem cells.